Clinical trial inclusion criterion:
Estimated life expectancy of at least 6 weeks following study entry

Entity relations:
- Has_value("Estimated life expectancy", "at least 6 weeks following study entry")